二尖瓣狹窄的病患需要用手術方式解決時，下列那一種方式現在比較少使用？
A. 直視下二尖瓣切開術（open mitral commissurotomy）
B. 閉鎖式二尖瓣切開術（closed mitral commissurotomy）
C. 氣球擴張術（balloon mitral valvuloplasty）
D. 二尖瓣置換術（mitral valve replacement）

正確答案：B. 閉鎖式二尖瓣切開術（closed mitral commissurotomy）